Clinical trial exclusion criterion:
Sensitivity to pilocarpine

Annotated entities:
- Condition: "Sensitivity"
- Drug: "pilocarpine"